參與電子傳遞鏈的蛋白質複合體使用那一種胺基酸形成 iron-sulfur center，輔助電子傳遞？
A. 丙胺酸（alanine）
B. 甲硫胺酸（methionine）
C. 色胺酸（tryptophan）
D. 半胱胺酸（cysteine）

正確答案：D. 半胱胺酸（cysteine）